La modificación diferencial del RNA:
1. Puede dar lugar a múltiples productos a partir de un gen.
2. Se produce gracias a la burbuja de transcripción.
3. Está catalizada por la RNA polimerasa I.
4. Está catalizada por la RNA polimerasa II.
5. Está catalizada por la RNA polimerasa III.

Respuesta correcta: 1. Puede dar lugar a múltiples productos a partir de un gen.